La determinación de oxígeno disuelto en muestras de agua natural, mediante el método de Winkler, se basa en la oxidación previa de Mn (II) en medio alcalino a:
1. Mn(IV).
2. Mn(VI).
3. Mn(VII).
4. Mn(V).
5. Mn(I).

Respuesta correcta: 1. Mn(IV).